Clinical trial exclusion criterion:
(5) For women of childbearing age, the following methods or methods of contraception use the effective method of contraception to be used during the period of this clinical trial:

Annotated entities:
- Pregnancy_considerations: "(5) For women of childbearing age, the following methods or methods of contraception use the effective method of contraception to be used during the period of this clinical trial:"